Clinical trial inclusion criteria:
Patients undergoing urologic surgery.

Annotated entities:
- Procedure: "urologic surgery"